AB0 compatible transplant.

The above is a clinical trial inclusion criterion. Annotated with entity spans:
[Qualifier: AB0 compatible] [Procedure: transplant].